¿Cómo se operativiza la recuperación de la depresión? (p. ej., Thase, 2003; APA, 2000):
1. Reducción de más de un 50% de síntomas desde la línea base.
2. Reducción de síntomas en más de un 75% desde la línea base.
3. Una puntuación mayor a 70 en la Escala de Evaluación de la Actividad Global (EEAG).
4. Cese de síntomas significativos mantenido durante al menos 6 meses y un retorno al funcionamiento normal.
5. Cese de síntomas significativos durante al menos los dos últimos meses.

Respuesta correcta: 4. Cese de síntomas significativos mantenido durante al menos 6 meses y un retorno al funcionamiento normal.